Clinical trial exclusion criterion:
Platelet count < 100,000/ml

Annotated entities:
- Measurement: "Platelet count"
- Value: "< 100,000/ml"